服用下列何種藥物最可能導致病人產生抗核抗體（antinuclear antibody）？
A. captopril
B. hydralazine
C. propranolol
D. prazosin

正確答案：B. hydralazine